Clinical trial inclusion criterion:
Patients older than 18 years

Annotated entities:
- Value: "older than 18"
- Person: "years"